Clinical trial inclusion criterion:
Initial radiotherapy field of treatment to encompass greater than or equal to 30% of the esophagus

Entity relations:
- Has_multiplier("esophagus", "greater than 30")
- Has_qualifier("radiotherapy", "Initial")
- Has_qualifier("radiotherapy", "esophagus")
- OR("greater than 30", "equal to 30%")